Long term use of aspirin or P2Y12 receptor antagonist within 1month

The above is a clinical trial exclusion criterion. Annotated with entity spans:
[Qualifier: Long term] use of [Drug: aspirin] or [Drug: P2Y12 receptor antagonist] [Temporal: within 1month]